De los siguientes mecanismos ¿Cuál conduce a una dilución de la orina?
1. Liberación de vasopresina.
2. Estimulación de los osmorreceptores.
3. Inhibición del sistema renina – angiotensina – aldosterona.
4. Hiperosmolaridad de la médula renal.

Respuesta correcta: 3. Inhibición del sistema renina – angiotensina – aldosterona.